Patient refusal.

The above is a clinical trial exclusion criterion. Annotated with entity spans:
[Post-eligibility: Patient refusal].